器官移植後的病人出現肺炎併發症，應首先懷疑下列何種病毒感染是導致肺炎併發症的原因？
A. 單純疹病毒（herpes simplex virus）
B. EB 病毒（Epstein-Barr virus）
C. 腺病毒（adenovirus）
D. 巨細胞病毒（cytomegalovirus）

正確答案：D. 巨細胞病毒（cytomegalovirus）